Clinical trial inclusion criterion:
Able to replace their current SABA treatment with study supplied rescue SABA provided at Visit 1 for use as needed for the duration of the study.

Annotated entities:
- Drug: "SABA"
- Drug: "rescue SABA"
- Subjective_judgement: "Able to replace their current SABA treatment with study supplied rescue SABA provided at Visit 1 for use as needed for the duration of the study."
- Non-query-able: "Able to replace their current SABA treatment with study supplied rescue SABA provided at Visit 1 for use as needed for the duration of the study."